¿Cuál de los siguientes síntomas se considera nuclear para el diagnóstico de la dislexia evolutiva superficial?:
1. El deterioro en la lectura de pseudopalabras en comparación con la de palabras.
2. La aparición concomitante de afasia.
3. Las palabras regulares, aunque sean desconocidas, tienen mayor probabilidad de ser leídas correctamente que las palabras irregulares.
4. La aparición de paralexias visuales y derivativas.

Respuesta correcta: 3. Las palabras regulares, aunque sean desconocidas, tienen mayor probabilidad de ser leídas correctamente que las palabras irregulares.